El (-)-deprenilo (o selegilina) es una propargilamina que se utiliza en el tratamiento de la enfermedad de Parkinson porque es:
1. Agonista del receptor D2 de dopamina.
2. Antagonista dopaminérgico.
3. Inhibidor de la COMT.
4. Profármaco de dopamina.
5. Inhibidor suicida de la MAO-B.

Respuesta correcta: 5. Inhibidor suicida de la MAO-B.